Clinical trial inclusion criteria:
physical status I - III
patients scheduled to undergo hip arthroplasty

Annotated entities:
- Measurement: "physical status"
- Value: "I - III"
- Procedure: "hip arthroplasty"
- Mood: "scheduled to undergo"